Clinical trial exclusion criterion:
5. Women who are pregnant or lactating.

Annotated entities:
- Condition: "pregnant"
- Person: "Women"
- Condition: "lactating"
- Pregnancy_considerations: "Women who are pregnant or lactating"